下列何者不是「假性內斜視」（pseudoesotropia）的原因？
A. 兩眼瞳孔間距太短
B. 顯	的內眥上皮皺摺（epicanthal folds）
C. 高度近視伴隨negative kappa angle
D. 早產兒網膜症造成黃斑部異位（ectopic macula）

正確答案：D. 早產兒網膜症造成黃斑部異位（ectopic macula）